Clinical trial inclusion criterion:
The second early induction start criteria is in addition to the listed above, the percentage of the blasts on the level >10% on 7th day.

Annotated entities:
- Measurement: "percentage of the blasts"
- Value: ">10%"
- Temporal: "on 7th day"